Clinical trial exclusion criterion:
taken adenosine diphosphate (ADP) receptor antagonists within 2 weeks

Annotated entities:
- Drug: "adenosine diphosphate (ADP) receptor antagonists"
- Temporal: "within 2 weeks"